下列何種病因，並非造成第二型糖尿病主要致病機轉？
A. 胰島素阻抗性
B. 胰島素分泌不足
C. 昇糖激素分泌不足
D. 游離脂肪酸過多

正確答案：C. 昇糖激素分泌不足